Pre-existing/chronic back pain

The above is a clinical trial exclusion criterion. Annotated with entity spans:
[Temporal: Pre-existing]/[Qualifier: chronic] [Condition: back pain]